卵細胞何時完成第一次減數分裂（meiosis I）？
A. 性成熟時（puberty）
B. 黃體化激素潮放（LH surge）時
C. 精子進入卵子之時
D. 受精後（fertilization）

正確答案：B. 黃體化激素潮放（LH surge）時